Clinical trial exclusion criterion:
Known hypersensitivity or contraindication to any of the following medications: heparin, aspirin, clopidogrel or contrast agents

Annotated entities:
- Condition: "hypersensitivity"
- Condition: "contraindication"
- Drug: "heparin"
- Drug: "aspirin"
- Drug: "clopidogrel"
- Drug: "contrast agents"